Clinical trial inclusion criterion:
Classification of the American Society of Anesthesiologists (ASA I-III)

Annotated entities:
- Measurement: "Classification of the American Society of Anesthesiologists"
- Measurement: "ASA"
- Value: "I-III"